Un hombre de 25 años consulta por ictericia. Practica el culturismo y se ha inyectado esteroides anabolizantes sustitutos del 17 alfaalquil, tres semanas antes. Por una amigdalitis había tomado amoxicilina-clavulánico que retiró hace 15 días. Analítica: AST 1200 UI/L (límite superior normal, lsn 40), ALT 1300 UI/L (lsn 40), GGT 150 UI/L (lsn 50), fosfatasa alcalina 180 UI/L (lsn 105), bililrrubina total 4,8 mg/dL con predominio de bilirrubina directa. Serología de virus B: Anti-HBs y Anti-HBc positivos. La ecografía sugiere esteatosis grado I. ¿Cuál es el diagnóstico más probable?
1. Hepatitis por amoxicilina-clavulánico.
2. Hepatitis por esteroides anabólicos.
3. Hepatitis aguda por virus B.
4. Esteatohepatitis no alcohólica.
5. Colestasis por fármacos.

Respuesta correcta: 1. Hepatitis por amoxicilina-clavulánico.